Clinical trial exclusion criterion:
Any active respiratory, cardiovascular or other disease requiring regular treatment or being otherwise relevant for tolerance of hypoxia or altitude exposure.

Entity relations:
- Has_qualifier("disease", "other")
- Has_qualifier("respiratory disease", "active")
- Has_qualifier("treatment", "regular")
- AND("tolerance", "hypoxia")
- Has_mood("tolerance", "relevant for")
- AND("respiratory disease", "treatment")
- OR("respiratory disease", "cardiovascular disease", "disease")
- OR("hypoxia", "altitude exposure")
- OR("respiratory disease", "tolerance")